Bradycardia (HR<55bpm)

The above is a clinical trial exclusion criterion. Annotated with entity spans:
[Condition: Bradycardia] ([Measurement: HR][Value: <55bpm])